How are CRM (cis-regulatory modules) defined?

Eukaryotic genes are often regulated by several transcription factors whose binding sites are tightly clustered and form cis-regulatory modules.